下列何者是兒童（非嬰兒）急性化膿性中耳炎之最常見致病的菌種？
A. Haemophilus influenzae
B. Pseudomonas aeruginosa
C. Klebsiella pneumoniae
D. Candida

正確答案：A. Haemophilus influenzae